Baseline serology showed a nonreactive RPR test

The above is a clinical trial exclusion criterion. Annotated with entity spans:
[Temporal: Baseline] [Procedure: serology] showed a [Value: nonreactive] [Measurement: RPR test]